Clinical trial exclusion criterion:
pregnant or breast feeding females

Annotated entities:
- Condition: "pregnant"
- Observation: "breast feeding"
- Person: "females"